Clinical trial exclusion criterion:
Subject has an active systemic infection.

Annotated entities:
- Condition: "systemic infection"
- Qualifier: "active"